Un parámetro de gran importancia en cromatografía es la altura equivalente de plato teórico (H). La ecuación de van Deemter describe el comportamiento de una columna de relleno para cromatografía gas-líquido, siendo H = A+(B/u) +Cu, de manera que:
1. C es el parámetro que se toma como medida de la calidad del relleno de la columna.
2. A es el coeficiente que recoge la contribución de la difusión longitudinal.
3. B es el parámetro que se relaciona con la resistencia a la transferencia de materia que opone la fase estacionaria.
4. u es la velocidad lineal de la fase móvil.
5. B se anula en columnas sin relleno.

Respuesta correcta: 4. u es la velocidad lineal de la fase móvil.